Clinical trial exclusion criterion:
Medical condition whose pathology or treatment would significantly increase the risk associated with the proposed protocol.

Annotated entities:
- Condition: "Medical condition"
- Qualifier: "would significantly increase the risk associated with the proposed protocol"